Clinical trial exclusion criterion:
Patients receiving drugs affecting immune system like immunosuppressive drugs.

Entity relations:
- Subsumes("drugs affecting immune system", "immunosuppressive drugs")